Clinical trial exclusion criteria:
multiple injuries (polytrauma patients)
previous adverse reaction or known allergy to local anaesthetics or opioids or paracetamol
skin infection in proximity of injection site
delirious state at presentation in the ED

Annotated entities:
- Condition: "multiple injuries"
- Condition: "polytrauma"
- Condition: "adverse reaction"
- Condition: "allergy"
- Procedure: "local anaesthetics"
- Drug: "opioids"
- Drug: "paracetamol"
- Condition: "skin infection"
- Qualifier: "injection site"
- Condition: "delirious"